賴同學，男性，17歲，就讀高二，因為服藥過量自殺被送到急診室。病史澄清顯示賴同學這次主要因感情問題，女友提分手而出現憂鬱症狀已達二個多月，過去沒有憂鬱或精神科病史。家族史顯示賴同學的爸爸有憂 	鬱症和	酒病史，父母離異，自小由母親帶大。關於賴同學這次憂鬱症的病因分析，下列敘述何者正確？
A. 父母離異是屬於社會性的前置因子（socio-predisposing）
B. 分手事件是屬於心理性的前置因子（psycho-predisposing）
C. 家族憂鬱症病史是屬於生物性的誘發因子（bio-precipitating）
D. 家族憂鬱症病史是屬於社會性的延續因子（socio-perpetuating）

正確答案：A. 父母離異是屬於社會性的前置因子（socio-predisposing）